Ineffective 1st line treatment (e.g. steroid IV, IVIg) and 2nd line treatment (e.g. Rituximab or cyclophosphamide)

The above is a clinical trial inclusion criterion. Annotated with entity spans:
[Qualifier: Ineffective] [Procedure: 1st line treatment] (e.g. [Drug: steroid IV], [Drug: IVIg]) and [Procedure: 2nd line treatment] (e.g. [Drug: Rituximab] or [Drug: cyclophosphamide])